Estimated life expectancy <12 months;

The above is a clinical trial exclusion criterion. Annotated with entity spans:
[Observation: Estimated life expectancy] [Value: <12 months];